Clinical trial exclusion criterion:
Pregnant woman whose ultrasonographic examination reveals congenital anomaly of the fetus

Entity relations:
- Has_value("ultrasonographic examination", "congenital anomaly of the fetus")